= 20years of age;

The above is a clinical trial inclusion criterion. Annotated with entity spans:
[Value: = 20years] of [Person: age];